NA

The above is a clinical trial exclusion criterion. Annotated with entity spans:
[Not_a_criteria: NA]